Clinical trial inclusion criteria:
histologically diagnosed primary classical osteosarcoma in extremities
staging IIB
MRI showing no skip lesion
receive standard neo-adjuvant chemotherapy, adjuvant chemotherapy,and standard surgical treatment

Annotated entities:
- Procedure: "histologically"
- Qualifier: "primary"
- Condition: "classical osteosarcoma"
- Qualifier: "in extremities"
- Qualifier: "staging IIB"
- Procedure: "MRI"
- Negation: "no"
- Observation: "skip lesion"
- Procedure: "standard neo-adjuvant chemotherapy"
- Procedure: "adjuvant chemotherapy"
- Procedure: "standard surgical treatment"